¿Cuál es aproximadamente la mejor resolución que se obtiene en la microscopía de campo claro?
1. 20 µm .
2. 2,0 µm .
3. 1,0 µm .
4. 0,2 µm .

Respuesta correcta: 4. 0,2 µm .